Una persona que no tiene esquizofrenia, ni un trastorno del estado de ánimo con síntomas psicóticos, pero que presenta un patrón profundo de desapego social y un rango limitado de expresión emocional en situaciones interpersonales (ej., disfrute con pocas actividades o es indiferente a la alabanza o la crítica), presenta con más probabilidad:
1. Un trastorno delirante.
2. Una fobia social.
3. Un trastorno de personalidad esquizoide.
4. Un trastorno de depersonalización.
5. Un síndrome de Korsakoff.

Respuesta correcta: 3. Un trastorno de personalidad esquizoide.